第三期梅毒的血管病變最常侵犯何處？
A. 升主動脈
B. 腹主動脈
C. 上腔靜脈
D. 下腔靜脈

正確答案：A. 升主動脈